下列何者不是alpha-receptor-blocking drugs 之臨床用途？
A. 高血壓（hypertension）
B. 注意力不足過動症（attention deficit hyperactivity disorder）
C. 雷諾氏現象（Raynaud's phenomenon）
D. 良性攝護腺肥大（benign prostatic hypertrophy）

正確答案：B. 注意力不足過動症（attention deficit hyperactivity disorder）